What is small-activating RNA?

small activating RNAs are double stranded RNAs (dsRNAs) that target gene promoters and trigger gene activation.